Clinical trial inclusion criterion:
Neutrophils > 1.5 109/l, Platelets > 100 109/l, Hemoglobin > 9g/dl, Total bilirubin < 1.5 UNL, AST (SGOT) and ALT (SGPT) < 2.5 UNL, Alkaline phosphatases < 5 UNL, Creatinine < 1 UNL

Annotated entities:
- Measurement: "Neutrophils"
- Value: "> 1.5 109/l"
- Measurement: "Platelets"
- Value: "> 100 109/l"
- Measurement: "Hemoglobin"
- Value: "> 9g/dl"
- Measurement: "Total bilirubin"
- Value: "< 1.5 UNL"
- Measurement: "ALT (SGPT)"
- Value: "< 2.5 UNL"
- Measurement: "AST (SGOT)"
- Measurement: "Alkaline phosphatases"
- Value: "< 5 UNL"
- Measurement: "Creatinine"
- Value: "< 1 UNL"